The patient or his/her representative refuses to sign the consent

The above is a clinical trial exclusion criterion. Annotated with entity spans:
[Informed_consent: The patient or his/her representative refuses to sign the consent]